Clinical trial inclusion criterion:
pregnant women in 30 to 32 weeks of gestation, with positive HBsAg and HBeAg,serum viral load above 8log10 copies per mL

Entity relations:
- Has_value("gestation", "30 to 32 weeks")
- Has_value("HBsAg", "positive")
- Has_value("serum viral load", "above 8log10 copies per mL")
- Has_value("HBeAg", "positive")